Clinical trial inclusion criterion:
Subjects must be pre-adolescent without any signs of puberty (Tanner Stage 1).

Entity relations:
- Has_negation("signs of puberty", "without any")
- Has_value("Tanner Stage", "1")
- Subsumes("signs of puberty", "Tanner Stage")